Clinical trial inclusion criterion:
Hepatitis B surface antigen (HBsAg) positive and <1500 IU/mL.

Annotated entities:
- Measurement: "Hepatitis B surface antigen"
- Measurement: "HBsAg"
- Value: "positive"
- Value: "<1500 IU/mL"